運動員因集訓而引起無月經，下列何者會下降？
A. LH
B. endophine
C. ACTH
D. androgen

正確答案：A. LH